Clinical trial exclusion criterion:
Hypersensitivity to a PCC

Entity relations:
- AND("Hypersensitivity", "PCC")